Clinical trial exclusion criterion:
10. History of alcohol abuse or other substance abuse within the last year.

Annotated entities:
- Condition: "alcohol abuse"
- Condition: "substance abuse"
- Temporal: "within the last year"